Clinical trial inclusion criterion:
5. If female and of childbearing potential, has a negative pregnancy test.

Annotated entities:
- Parsing_Error: "5."
- Condition: "childbearing potential"
- Person: "female"
- Measurement: "pregnancy test"
- Value: "negative"